Clinical trial exclusion criterion:
Major depressive disorder in the last year requiring treatment

Annotated entities:
- Condition: "Major depressive disorder"
- Temporal: "last year"
- Procedure: "treatment"